關於酒精相關疾患，下列何者錯誤？
A. Wernicke 症候群是急性症候群
B. Wernicke-Korsakoff 症候群以thiamine治療
C. Korsakoff 症候群會近期記憶變差
D. Korsakoff 症候群治療後大多可完全恢復

正確答案：D. Korsakoff 症候群治療後大多可完全恢復